Where does gemtuzumab ozogamicin bind?

Gemtuzumab ozogamicin binds to CD33